患者主訴便秘及排便失禁，理學檢查發現肛門鬆弛無自主收縮能力，肛門反射及球海綿體肌反射（bulbocavernosus reflex）皆消失，下列何者是最可能的病因？
A. 顱內出血（intracranial hemorrhage）
B. 腦幹中風（brainstem stroke）
C. 頸髓空洞症（cervical syringomyelia）
D. 馬尾束病變（cauda equina lesion）

正確答案：D. 馬尾束病變（cauda equina lesion）